Anticipated survival of less than 3 months.

The above is a clinical trial exclusion criterion. Annotated with entity spans:
[Observation: Anticipated survival] of [Value: less than 3 months].